Chronic HBV/HIV infection

The above is a clinical trial exclusion criterion. Annotated with entity spans:
Chronic HBV/[Condition: HIV infection]